2-hour C-peptide level < 1.8 ng/mL.

The above is a clinical trial exclusion criterion. Annotated with entity spans:
[Measurement: 2-hour C-peptide level] [Value: < 1.8 ng/mL].